Clinical trial inclusion criterion:
Participants must be able to understand and sign the Informed Consent, and comply with all aspects of the protocol.

Annotated entities:
- Mood: "be able to"
- Informed_consent: "understand and sign the Informed Consent"
- Informed_consent: "comply with all aspects of the protocol"